El análisis de la varianza (Anova) de una vía:
1. Compara medias de 3 o más muestras independientes.
2. Compara varianzas de 3 o más muestras independientes.
3. Es un test de hipótesis no paramétrico.
4. Utiliza la distribución t de Student.

Respuesta correcta: 1. Compara medias de 3 o más muestras independientes.